Clinical trial exclusion criterion:
7. History of any cerebrovascular accident;

Entity relations:
- AND("History of", "any cerebrovascular accident")